Una mujer de 90 años demenciada, incontinente e inmovilizada por hemiparesia presenta una úlcera sacra de grado III. En la exploración vemos que está en la cama sobre una almohadilla húmeda y con una sonda de alimentación que está bien colocada. Está afebril y tiene un pulso y una tensión arterial normales. Tiene una úlcera sacra de 4 x 4 cm que se extiende hacia la fascia con exudado verde y piel normal que rodea la úlcera. ¿Cuál es la primera prioridad en los cuidados de esta paciente?
1. Empezar tratamiento con antibióticos.
2. Cultivar el exudado del decúbito.
3. Aplicar vendajes semihúmedos de solución salina tres veces al día.
4. Hacer cambios posturales a la paciente cada dos horas.
5. Colocar una sonda urinaria permanente.

Respuesta correcta: 4. Hacer cambios posturales a la paciente cada dos horas.